30歲女性，已有連續4次懷孕都在第一孕期就自然流產，醫師建議做夫妻的染色體檢查，結果夫妻中一方有異 常，最有可能的異常是：
A. trisomy 18
B. balanced translocation
C. Turner syndrome
D. Klinefelter syndrome

正確答案：B. balanced translocation